Informed consent

The above is a clinical trial inclusion criterion. Annotated with entity spans:
[Non-query-able: Informed consent]